Clinical trial exclusion criterion:
Intolerance/allergy to local anesthetics

Annotated entities:
- Condition: "Intolerance"
- Condition: "allergy"
- Drug: "local anesthetics"